Be judged not suitable to participate the study by the investigators

The above is a clinical trial exclusion criterion. Annotated with entity spans:
[Non-query-able: Be judged not suitable to participate the study by the investigators]